Clinical trial inclusion criteria:
adults capable of providing consent
have a diagnosis of locally advanced or metastatic melanoma

Annotated entities:
- Person: "adults"
- Informed_consent: "capable of providing consent"
- Condition: "melanoma"
- Qualifier: "metastatic"
- Qualifier: "locally advanced"